List all articles on network meta-analysis for smoking cessation

Cardiovascular events associated with smoking cessation pharmacotherapies: a network meta-analysis.
Pharmacological interventions for smoking cessation: an overview and network meta-analysis
Effectiveness and cost-effectiveness of computer and other electronic aids for smoking cessation: a systematic review and network meta-analysis.
Smoking cessation interventions in COPD: a network meta-analysis of randomised trials.